Obesity defined as BMI>30

The above is a clinical trial exclusion criterion. Annotated with entity spans:
[Condition: Obesity] defined as [Measurement: BMI][Value: >30]